Clinical trial inclusion criterion:
5. Currently using carbohydrate counting as the meal insulin dose strategy.

Entity relations:
- AND("meal insulin dose strategy", "carbohydrate counting")
- Has_temporal("carbohydrate counting", "Currently")